Clinical trial exclusion criterion:
St.p. cervical tear

Annotated entities:
- Condition: "St.p."
- Procedure: "cervical tear"